Clinical trial inclusion criterion:
have undergone oro-tracheal intubation for a coma (Glasgow Coma Score below or equal to 8),

Entity relations:
- AND("oro-tracheal intubation", "coma")
- Has_value("Glasgow Coma Score", "below or equal to 8)")
- AND("coma", "Glasgow Coma Score")